Clinical trial exclusion criterion:
Platelets <100 K/cumm

Entity relations:
- Has_value("Platelets", "<100 K/cumm")